Clinical trial exclusion criterion:
menopause

Annotated entities:
- Condition: "menopause"